下列何者為benzodiazepine的競爭性拮抗劑？
A. pralidoxime
B. guanethidine
C. flumazenil
D. paraldehyde

正確答案：C. flumazenil